76歲李先生因胸痛來急診，初步診斷為右心室心肌梗塞（right ventricular infarction），血壓為76/44 mmHg，下列何項處置最不恰當？
A. 給予氧氣
B. 給予抗血小板藥物（antiplatelet agents）
C. 給予血栓溶解藥物（fibrinolytic agents）
D. 給予硝化甘油（nitroglycerin）

正確答案：D. 給予硝化甘油（nitroglycerin）